Clinical trial exclusion criterion:
Patients who are making use of antidepressants, diuretics or anticoagulants;

Entity relations:
- OR("antidepressants", "diuretics", "anticoagulants")